Clinical trial exclusion criterion:
Pregnancy.

Annotated entities:
- Condition: "Pregnancy"